¿Cuál es el primer nivel de organización del ADN en los cromosomas’:
1. Histonas.
2. Nucleosomas.
3. Cadenas azúcar-fosfato.
4. Proteosomas.
5. Nucleótidos.

Respuesta correcta: 2. Nucleosomas.